Clinical trial exclusion criterion:
Allergy to ascorbic acid

Entity relations:
- AND("Allergy", "ascorbic acid")